Clinical trial exclusion criteria:
Non-reassuring fetal assessment at the time of recruitment
Previous cervical ripening agents (cytotec, cervidil, cervical Foley Balloon)
<18 years of age
Prisoners
Any patients contraindicated for vaginal delivery
Multiple gestations
History of previous cesarean delivery
Patients with history of significant cardiac disease
Fetal demise
Estimated fetal weight greater than 4500 grams in diabetic and 5000 grams in non-diabetic mother
Ruptured membranes
Spontaneous labor (latent or active phase)
Augmentation of labor (latent or active phase)

Annotated entities:
- Value: "Non-reassuring"
- Measurement: "fetal assessment"
- Temporal: "at the time of recruitment"
- Temporal: "Previous"
- Drug: "cervical ripening agents"
- Drug: "cytotec"
- Drug: "cervidil"
- Device: "cervical Foley Balloon"
- Person: "age"
- Value: "<18 years"
- Person: "Prisoners"
- Condition: "contraindicated"
- Procedure: "vaginal delivery"
- Observation: "Multiple gestations"
- Temporal: "History"
- Temporal: "previous"
- Procedure: "cesarean delivery"
- Temporal: "history"
- Qualifier: "significant"
- Condition: "cardiac disease"
- Condition: "Fetal demise"
- Measurement: "Estimated fetal weight"
- Value: "greater than 4500 grams"
- Condition: "diabetic"
- Value: "5000 grams"
- Negation: "non-"
- Condition: "diabetic"
- Condition: "Ruptured membranes"
- Condition: "Spontaneous labor"
- Qualifier: "latent phase"
- Qualifier: "active phase"
- Condition: "Augmentation of labor"
- Qualifier: "latent phase"
- Qualifier: "active phase"